Clinical trial exclusion criterion:
Tuberculosis

Annotated entities:
- Condition: "Tuberculosis"